Clinical trial exclusion criterion:
Unwilling to discontinue anti-TNF agent

Annotated entities:
- Mood: "Unwilling"
- Procedure: "discontinue"
- Drug: "anti-TNF agent"